下列有關器官移植時各種排斥現象（rejection）的敘述，何者有誤？
A. 一般而言，Donor 與 Recipient 的 HLA matching 愈佳，則 graft survival rate 愈好
B. Hyperacute rejection 的發生需要 IgM antibodies 的媒介，可藉由使用抗排斥藥物加以預防
C. Acute rejection 的發生需要 T lymphocytes 的媒介，發生頻率愈高，graft 的長期預後較差
D. Chronic rejection 的發生與 T cell 與 B cell 有關，移植器官的主要病理變化為 fibrosis and scarring

正確答案：B. Hyperacute rejection 的發生需要 IgM antibodies 的媒介，可藉由使用抗排斥藥物加以預防